Clinical trial inclusion criterion:
Scheduled for elective video-assisted thoracic surgery

Annotated entities:
- Qualifier: "elective"
- Mood: "Scheduled for"
- Procedure: "video-assisted thoracic surgery"